Clinical trial exclusion criterion:
Metastatic breast cancer.

Entity relations:
- Has_qualifier("breast cancer", "Metastatic")